Explain amniotic band syndrome.

Amniotic band syndrome is a rare congenital disorder characterized by the association of bilateral microtia, aplasia or hypoplasia of the upper aerodigestive tract, and severe pre- and postnatal growth retardation.